Clinical trial exclusion criterion:
17. Subject with life expectancy less than 6 months as assessed by investigators;

Annotated entities:
- Value: "less than 6 months"
- Observation: "life expectancy"